有關肥胖病患（BMI>30）的生理變化與手術前評估敘述，下列何者錯誤？
A. 肥胖病患循環血量增加，心搏輸出增加，耗氧量亦增加，心臟易缺血
B. 肥胖病患的每分鐘呼吸次數與通氣量不變
C. 在腸胃道方面，肥胖病患易有胃食道逆流
D. 肥胖病患通常困難插管的機會較高

正確答案：B. 肥胖病患的每分鐘呼吸次數與通氣量不變